El sincitio auricular está separado del ventricular por:
1. Las válvulas aurículo-vetriculares.
2. Las válvulas semilunares.
3. El esqueleto fibroso.
4. El tabique interventricular.
5. El Haz de His.

Respuesta correcta: 3. El esqueleto fibroso.